Clinical trial inclusion criterion:
Age = 18 years and = 50 years

Annotated entities:
- Person: "Age"
- Value: "= 18 years and = 50 years"